下列關於腸脛束（iliotibial band）及其摩擦徵候群（friction syndrome）的敘述，何者錯誤？
A. 有脛骨內旋（internal rotation）現象者較易發生本症狀
B. 腸脛束的近端（proximal part）連接闊筋膜張肌（tensor of fascia lata）
C. 腸脛束附著於脛骨結節（tibial tuberosity）
D. 騎腳踏車會惡化症狀

正確答案：C. 腸脛束附著於脛骨結節（tibial tuberosity）